下列有關切口性疝氣（incisional hernia）之敘述，何者錯誤？
A. 源自過去腹部手術傷口張力太大或癒合不良
B. 術後傷口感染為原因之一
C. 外科手術是唯一有效的治療辦法
D. 一定要用人工膜（mesh）來修補缺口

正確答案：D. 一定要用人工膜（mesh）來修補缺口